Patients who undergo iliac crest bone graft harvesting as part of their surgery

The above is a clinical trial exclusion criterion. Annotated with entity spans:
Patients who undergo [Procedure: iliac crest bone graft harvesting] as part of their surgery